Clinical trial exclusion criterion:
Patients with respiratory distress syndrome

Annotated entities:
- Condition: "respiratory distress syndrome"